Clinical trial inclusion criterion:
Patient must have been on a commercially approved anticoagulation therapy for at least two (2) months prior to randomization in the OAT Study.

Annotated entities:
- Drug: "anticoagulation therapy"
- Temporal: "at least two (2) months prior to randomization"
- Reference_point: "randomization"